Clinical trial exclusion criteria:
Subjects with poor-controlled arterial hypertension (systolic blood pressure> 140 mmHg and diastolic blood pressure > 90 mm Hg) despite standard medical management; Coronary heart disease greater than ClassII; II-level arrhythmia (including QT interval prolongation, for man = 450 ms, for woman = 470 ms) together with Class II cardiac dysfunction;
Factors that could have an effect on oral medication (such as inability to swallow, chronic diarrhea and intestinal obstruction);
Subjects with high gastrointestinal bleeding risk, including the following conditions: local active ulcer lesions with positive fecal occult blood test (++); history of black stool, or vomiting blood in the past 3 months;unresected primary lesion in stomach with positive fecal occult blood test (+), ulcerated gastric carcinoma with massive alimentary tract bleeding risk judged by PIs based on gastric endoscopy result;
Abnormal Coagulation (INR>1.5<U+3001>APTT>1.5 UNL), with tendency of bleed;
Associated with CNS (central nervous system) metastases;
Pregnant or lactating women;
Other conditions regimented at investigators' discretion.

Annotated entities:
- Condition: "arterial hypertension"
- Qualifier: "poor-controlled"
- Measurement: "systolic blood pressure"
- Value: "> 140 mmHg"
- Measurement: "diastolic blood pressure"
- Value: "> 90 mm Hg"
- Condition: "Coronary heart disease"
- Qualifier: "greater than ClassII"
- Condition: "arrhythmia"
- Qualifier: "II-level"
- Qualifier: "Subjects"
- Condition: "QT interval prolongation"
- Condition: "cardiac dysfunction"
- Qualifier: "Class II"
- Condition: "inability to swallow"
- Condition: "chronic diarrhea"
- Condition: "intestinal obstruction"
- Observation: "gastrointestinal bleeding risk"
- Qualifier: "high"
- Condition: "ulcer lesions"
- Qualifier: "active"
- Measurement: "fecal occult blood test"
- Value: "positive"
- Value: "++"
- Condition: "black stool"
- Condition: "vomiting blood"
- Temporal: "past 3 months"
- Condition: "primary lesion"
- Qualifier: "stomach"
- Measurement: "fecal occult blood test"
- Value: "positive"
- Value: "+"
- Condition: "ulcerated gastric carcinoma"
- Qualifier: "alimentary tract"
- Qualifier: "massive"
- Observation: "bleeding risk"
- Condition: "Abnormal Coagulation"
- Measurement: "INR"
- Value: ">1.5"
- Measurement: "APTT"
- Value: ">1.5 UNL"
- Condition: "tendency of bleed"
- Condition: "metastases CNS"
- Pregnancy_considerations: "Pregnant or lactating women"
- Non-query-able: "Other conditions regimented at investigators' discretion"